慢性心臟衰竭的患者不會因為下列何種因素產生急性惡化？
A. 心肌梗塞
B. 懷孕
C. 喝酒
D. 抽菸

正確答案：D. 抽菸